Clinical trial inclusion criterion:
Alcohol misuse as defined by the Alcohol Use Disorders Identification Test (AUDIT) score subjects must score > 8 (associated with harmful or hazardous drinking)

Annotated entities:
- Condition: "Alcohol misuse"
- Measurement: "Alcohol Use Disorders Identification Test (AUDIT) score"
- Value: "> 8"